Clinical trial inclusion criterion:
normal OGTT

Entity relations:
- Has_value("OGTT", "normal")